Clinical trial exclusion criterion:
Allergy to used drugs (PEG, neomycin, metronidazole)

Annotated entities:
- Drug: "drugs"
- Condition: "Allergy"
- Drug: "PEG"
- Drug: "neomycin"
- Drug: "metronidazole"